Clinical trial exclusion criterion:
current antibiotic use.

Annotated entities:
- Drug: "antibiotic use"
- Temporal: "current"